Clinical trial exclusion criterion:
Body mass index > 35

Entity relations:
- Has_value("Body mass index", "> 35")